Clinical trial exclusion criterion:
Patient has history of loose or watery stools

Annotated entities:
- Condition: "watery stools"
- Condition: "loose stools"
- Temporal: "history of"